Clinical trial exclusion criterion:
Patients whose tracheas were not extubated in OR or PACU.

Entity relations:
- Has_negation("extubated", "not")
- Has_qualifier("extubated", "tracheas")
- AND("extubated", "OR")
- OR("OR", "PACU")